Clinical trial exclusion criterion:
Patient whom the surgery is converted to laparotomy

Annotated entities:
- Procedure: "surgery"
- Observation: "converted to"
- Procedure: "laparotomy"